正常人將上肢外展（abduction）90 度時，來自於肱骨外展和肩胛骨外旋（rotation）之貢獻度分別為 多少？
A. 80° 和 10°
B. 70° 和 20°
C. 60° 和 30°
D. 50° 和 40°

正確答案：C. 60° 和 30°